Clinical trial inclusion criterion:
Gestational age 27 0/7 to 36 6/7 weeks;

Annotated entities:
- Measurement: "Gestational age"
- Value: "27 0/7 to 36 6/7 weeks"